下列那一位病人的膽囊結石需治療，而且以使用口服膽鹽溶石劑（ursodeoxycholic acid, UDCA）來治療較合 適？
A. 28歲婦女，有單顆1.0公分大小的膽結石在膽囊內；未曾有過症狀
B. 72歲男人，已有數次右上腹疼痛，合併噁心嘔吐，胸部X光顯示右上腹膽囊部位有鈣化點；超音波顯示有3 個膽結石，各為0.5公分大小
C. 60歲婦女，右上腹疼痛已12小時，併有噁心嘔吐，體溫38°C，超音波顯示有3顆膽結石，直徑為1～2公分，膽囊壁厚，而膽囊周圍有液體滯留
D. 70歲婦女，已有數次劇烈上腹痛，每次持續1～2小時，常於大餐之後發生，於2個月前才發作1次急性心肌梗塞。腹部X光看不到異常處，超音波顯示有1顆直徑大小0.4公分的膽結石

正確答案：D. 70歲婦女，已有數次劇烈上腹痛，每次持續1～2小時，常於大餐之後發生，於2個月前才發作1次急性心肌梗塞。腹部X光看不到異常處，超音波顯示有1顆直徑大小0.4公分的膽結石